一位 21 歲男性因多尿及夜尿多年至門診就診，血液檢查發現：鈉 158 mmol/L，鉀 3.7 mmol/L，氯 124 mmol/L，尿液檢查發現鈉 12 mmol/L，鉀 6 mmol/L，肌酸酐 32 mg/dL，滲透度 60 mosm/kg H2O， desmopressin（DDAVP）測試發現尿液滲透度上升至 500 mosm/kg H2O，下列敘述何者正確？
A. 病患為 primary polydipsia
B. 病患為腎因性尿崩症
C. 病患為中樞性尿崩症
D. 病患為滲透性利尿症（osmotic diuresis）

正確答案：C. 病患為中樞性尿崩症